Completed "ALO-IIT-012(PEAK study)", without major protocol deviations.

The above is a clinical trial inclusion criterion. Annotated with entity spans:
[Post-eligibility: Completed "ALO-IIT-012(PEAK study)", without major protocol deviations].